Clinical trial exclusion criterion:
contraindications to brachial plexus block (e.g., allergy to local anaesthetics, malignancy or infection in the area);

Entity relations:
- AND("contraindications", "brachial plexus block")
- AND("allergy", "local anaesthetics")
- Has_qualifier("infection", "in the area")
- Has_qualifier("malignancy", "in the area")
- Subsumes("contraindications", "allergy")
- OR("allergy", "infection", "malignancy")